下列何者不是胸部脊髓損傷（thoracic spinal cord injury）病患之臨床特徵？
A. impaired pinprick sensation below T6
B. reduced abdominal reflex
C. presence of Babinski sign
D. hyperactive biceps reflex

正確答案：D. hyperactive biceps reflex